Clinical trial inclusion criterion:
have a negative urine or blood pregnancy test at enrolment and prior to randomization;

Annotated entities:
- Pregnancy_considerations: "have a negative urine or blood pregnancy test at enrolment and prior to randomization;"